A history of active hemorragge, ulcer, intestinal perforation, intestinal obstruction, or major surgery no older than 30 days;

The above is a clinical trial exclusion criterion. Annotated with entity spans:
A history of [Qualifier: active] [Condition: hemorragge], [Condition: ulcer], [Condition: intestinal perforation], [Condition: intestinal obstruction], or [Condition: major surgery] [Temporal: no older than 30 days];